Clinical trial exclusion criterion:
Planned cardiac surgery or planned major non-cardiac surgery within the study period.

Annotated entities:
- Temporal: "within the study period"
- Procedure: "surgery"
- Qualifier: "cardiac"
- Negation: "non"
- Qualifier: "major"
- Mood: "planned"
- Procedure: "cardiac surgery"
- Mood: "Planned"
- Reference_point: "study period"